Clinical trial exclusion criterion:
Have, in the opinion of the investigator, evidence of alcohol, drug or solvent abuse.

Entity relations:
- AND("alcohol abuse", "in the opinion of the investigator")
- OR("alcohol abuse", "drug abuse", "solvent abuse")